La distribución T se aproxima a la normal:
1. A medida que aumentan los grados de libertad.
2. Nunca, porque son dos distribuciones distintas.
3. Cuando tenemos entre 0 y 30 grados de libertad.
4. Si el muestreo es aleatorio.

Respuesta correcta: 1. A medida que aumentan los grados de libertad.